下列那一個鴉片類藥物相較於morphine有較高的口服生體可用率（bioavailability），且產生依賴性的時程較慢，可用於鴉片類藥物成癮之替代療法？
A. nalbuphine
B. fentanyl
C. methadone
D. hydromorphine

正確答案：C. methadone